Pregnant women with abdomen discumfort and ultrasound diagnosis of polyhydramnios (AFI>25cm)

The above is a clinical trial inclusion criterion. Annotated with entity spans:
[Condition: Pregnant] [Person: women] with [Condition: abdomen discumfort] and [Procedure: ultrasound] [Value: diagnosis] of [Condition: polyhydramnios] ([Measurement: AFI][Value: >25cm])